Patients taking psychotropic medications or illicit drugs that may alter cognition, concentration, or behavior. Appropriate treatment by a licensed provider with medications for depression or anxiety, including but not limited to SSRIs, SNRIs, and standard dose benzodiazepines at a stable dose, is permitted

The above is a clinical trial exclusion criterion. Annotated with entity spans:
Patients taking [Drug: psychotropic medications] or [Drug: illicit drugs] that may [Condition: alter cognition], concentration, or behavior. [Non-representable: Appropriate treatment by a licensed provider with medications for depression or anxiety, including but not limited to SSRIs, SNRIs, and standard dose benzodiazepines at a stable dose, is permitte]d